Clinical trial exclusion criterion:
History of a sunny holiday, UV-light therapy or solarium use within one month before beginning of study treatments, or planning such during the study or within 7 days after the study

Entity relations:
- Has_temporal("sunny holiday", "within one month before beginning of study treatments")
- Has_mood("sunny holiday", "planning")
- Has_temporal("planning", "during the study")
- Has_index("within one month before beginning of study treatments", "beginning of study treatments")
- OR("during the study", "within 7 days after the study")
- OR("sunny holiday", "UV-light therapy", "solarium use")